Clinical trial inclusion criterion:
colorectal cancer above to 12 cm from the anal verge

Annotated entities:
- Condition: "colorectal cancer"
- Qualifier: "above to 12 cm from the anal verge"